在硬皮症之免疫病變中，下列何種細胞激素，可明顯地影響組織內 fibroblast 產生大量之膠原纖維？
A. tumor necrosis factor-α
B. transforming growth factor-β
C. interleukin-4
D. interferon-α

正確答案：B. transforming growth factor-β